下列有關男性乳癌（Male breast cancer）之敘述，何者正確？
A. 通常預後比女性乳癌為佳
B. 施行乳房根除手術（Radical mastectamy）之比率比女性乳癌為低
C. 施行內分泌處置（Endocrine manipulation）不像女性乳癌較有臨床意義及效果
D. 男性乳癌占所有乳癌約 1%

正確答案：D. 男性乳癌占所有乳癌約 1%